臨床上最常見的庫欣氏症候群（Cushing's syndrome）原因是：
A. 腎上腺皮質腫瘤
B. 腦下垂體腫瘤
C. 類固醇過量使用
D. 胸腺腫瘤

正確答案：C. 類固醇過量使用